Clinical trial exclusion criterion:
Neoadjuvant therapy for current breast cancer diagnosis

Entity relations:
- AND("Neoadjuvant therapy", "breast cancer")